Clinical trial inclusion criteria:
Overweight and obese PCOS patients with newly diagnosed IGR;
PCOS diagnosis based on 2003 Rotterdam criteria
Overweight / obesity diagnostic criteria according to WHO-WPR
Impaired glucose regulation diagnostic criteria according to 1998 WHO diagnostic criteria.

Annotated entities:
- Condition: "Overweight"
- Condition: "obese"
- Condition: "PCOS"
- Temporal: "newly diagnosed"
- Condition: "IGR"
- Condition: "PCOS"
- Qualifier: "2003 Rotterdam criteria"
- Condition: "Overweight"
- Condition: "obesity"
- Qualifier: "WHO-WPR"
- Condition: "Impaired glucose regulation"
- Qualifier: "1998 WHO diagnostic criteria"